Clinical trial inclusion criterion:
Understand and are willing to comply with the study requirements, including agreeing to be available for the follow-up evaluations

Annotated entities:
- Observation: "willing to comply with the study requirements"
- Observation: "Understand the study requirements"